What is the main difference between nascent and mature chromatin?

The nascent and mature forms of chromatin differ in two aspects of their histone modifications: polycistronic messengers are expressed as a sequence of individual nucleosomes only in mature chromatin, and the nucleosome is involved in both transcription and repair processes.